Patients with a history of, or at imminent risk for, colectomy; who required gastrointestinal surgery within 2 months before screening;

The above is a clinical trial exclusion criterion. Annotated with entity spans:
Patients with a [Temporal: history of], or at [Mood: imminent risk for], [Procedure: colectomy]; who required [Procedure: gastrointestinal surgery] [Temporal: within 2 months before screening];